Clinical trial inclusion criterion:
Willing to return for follow up Visit 3

Entity relations:
- Has_mood("follow up Visit 3", "Willing to")